Clinical trial exclusion criterion:
Women pregnant or lactating.

Entity relations:
- OR("pregnant", "lactating")